Sclerostin regulates what process?

Sclerostin plays a critical role in bone homeostasis and its deficiency or pharmacological neutralization increases bone formation